子宮頸防癌抹片取樣最重要的位置是：
A. squamous epithelium
B. columnar epithetlium
C. vaginal fornix
D. transformation zone

正確答案：D. transformation zone